Clinical trial inclusion criterion:
ASA (American Society of Anesthesiologists) class 1 & 2,

Annotated entities:
- Measurement: "ASA"
- Value: "class 1 & 2"